Clinical trial exclusion criterion:
no previously demonstrated clinically significant allergy or hypersensitivity to any of the excipients of the investigational medication administered in this trial

Annotated entities:
- Temporal: "previously"
- Qualifier: "clinically significant"
- Condition: "allergy"
- Condition: "hypersensitivity"
- Drug: "excipients of the investigational medication"